Clinical trial exclusion criterion:
Patient has previously been randomized in this study

Annotated entities:
- Non-query-able: "Patient has previously been randomized in this study"